Non survivable injury

The above is a clinical trial exclusion criterion. Annotated with entity spans:
[Qualifier: Non survivable] [Condition: injury]